psychiatric complaints that interfere with the correct use of the devices

The above is a clinical trial exclusion criterion. Annotated with entity spans:
[Condition: psychiatric complaints] that [Mood: interfere with] the [Observation: correct use of the devices]